Use of a non-hormonal form of contraception, such as: sterilization (tubal ligation, Essure), copper IUD (intrauterine device), barrier methods or abstinence

The above is a clinical trial inclusion criterion. Annotated with entity spans:
Use of a [Procedure: non-hormonal form of contraception], such as: [Procedure: sterilization] ([Procedure: tubal ligation], [Procedure: Essure]), [Procedure: copper IUD] ([Procedure: intrauterine device]), [Procedure: barrier methods] or [Observation: abstinence]